Kienböck Disease 是下列那一個腕骨發生了缺血性壞死？
A. Scaphoid
B. Capitate
C. Lunate
D. Hamate

正確答案：C. Lunate